Clinical trial exclusion criterion:
Subjects with femoral CICCs

Annotated entities:
- Device: "femoral CICCs"